Severe autoimmune disease, e.g. lupus erythematosus, multiple sclerosis.

The above is a clinical trial exclusion criterion. Annotated with entity spans:
[Qualifier: Severe] [Condition: autoimmune disease], e.g. [Condition: lupus erythematosus], [Condition: multiple sclerosis].